Appendiceal tip 的位置在以下那一處為最常見？
A. subcecal
B. retrocecal
C. pelvic
D. preileal

正確答案：B. retrocecal